Clinical trial exclusion criterion:
3. Were taking class 1 anti-arrhythmic drugs (e.g., mexiletine, tocainide)

Annotated entities:
- Drug: "class 1 anti-arrhythmic drugs"
- Drug: "mexiletine"
- Drug: "tocainide"